Male and females between ages 18-85 years of age

The above is a clinical trial inclusion criterion. Annotated with entity spans:
[Person: Male] and [Person: females] [Value: between] [Person: ages] 18-85 years of age